眼球要往外上方（temporal upper）看時，須靠外直肌（lateral rectus muscle）和下列何條眼外肌共同作用？
A. 上直肌（superior rectus muscle）
B. 上斜肌（superior oblique muscle）
C. 下直肌（inferior rectus muscle）
D. 下斜肌（inferior oblique muscle）

正確答案：A. 上直肌（superior rectus muscle）